Serum creatinine level > 2.0 mg/dL

The above is a clinical trial exclusion criterion. Annotated with entity spans:
[Measurement: Serum creatinine level] [Value: > 2.0 mg/dL]